Clinical trial inclusion criterion:
Subject has inadequate tissue coverage over the operative site.

Entity relations:
- Has_qualifier("inadequate tissue coverage", "operative site")